Clinical trial exclusion criterion:
History of malignancy including leukemia and lymphoma (but not basal cell skin carcinoma) within the past five years

Entity relations:
- Subsumes("malignancy", "leukemia")
- Subsumes("malignancy", "basal cell skin carcinoma")
- Has_temporal("malignancy", "within the past five years")
- OR("leukemia", "lymphoma")